Any intraocular surgery in the study eye within the last 90 days prior to study enrollment.

The above is a clinical trial exclusion criterion. Annotated with entity spans:
Any [Procedure: intraocular surgery] [Qualifier: in the study eye] [Temporal: within the last 90 days prior to study enrollment].